Acute infections within the last four weeks prior to Screening

The above is a clinical trial exclusion criterion. Annotated with entity spans:
[Condition: Acute infections] [Temporal: within the last four weeks prior to Screening]